Clinical trial exclusion criterion:
Exclusions Related to Pulmonary Disease

Annotated entities:
- Parsing_Error: "Exclusions Related to Pulmonary Disease"